Current HAMD-17 score = 20 and the duration of the index episode is greater than or equal to four weeks.

The above is a clinical trial inclusion criterion. Annotated with entity spans:
[Temporal: Current] [Measurement: HAMD-17] [Value: score = 20] and the duration of the [Condition: index episode] is [Temporal: greater than or equal to four weeks].